下列那個疾病常併發有聽力障礙？
A. Adult-type polycystic kidney disease
B. Alport's syndrome
C. Henoch-Scholein purpura
D. Goodpasture's syndrome

正確答案：B. Alport's syndrome